Clinical trial inclusion criterion:
All patients presenting for elective shoulder arthroscopic procedures will be eligible for enrollment.

Entity relations:
- Has_qualifier("shoulder arthroscopic procedures", "elective")